Clinical trial exclusion criterion:
History of cancer (within the last year)

Annotated entities:
- Condition: "cancer"
- Temporal: "last year"